What is the treatment of neuropathic pain in children?

It is unclear if any treatment is registered for pediatric use. The reported treatments are:
Oxcarbazepine 
Opioids alone, in rotations  or with Analgesics (e.g. Ketamine and Lidocaine infusion)
Opioids and Benzodiazepines
Pregabalin -  is one of the first drugs registered for the treatment of neuropathic pain. It is unclear if Pregabalin is registered for the treatment of neuropathic pain in children specifically but it is being used in practice.
Tricyclic Antidepressants
Lidocaine 5% patches for chronic localized neuropathic pain